Clinical trial exclusion criterion:
laparoscopic bowel or solid organ resection except laparoscopic cholecystectomy

Entity relations:
- Has_negation("laparoscopic cholecystectomy", "except")
- AND("laparoscopic bowel resection", "laparoscopic cholecystectomy")
- OR("laparoscopic bowel resection", "solid organ resection")